Clinical trial exclusion criterion:
Patients with history of significant cardiac disease

Entity relations:
- Has_qualifier("cardiac disease", "significant")
- Has_temporal("cardiac disease", "history")